Clinical trial inclusion criterion:
6. Negative pregnancy test

Entity relations:
- Has_value("pregnancy test", "Negative")